Clinical trial exclusion criterion:
History of previous musculoskeletal injury of the same knee for excluding patients with secondary knee osteoarthritis

Entity relations:
- Has_qualifier("musculoskeletal injury", "knee")
- OR("musculoskeletal injury", "secondary knee osteoarthritis")